Clinical trial exclusion criterion:
HIV co-infection if on a protease inhibitor based regimen

Annotated entities:
- Condition: "HIV co-infection"
- Drug: "protease inhibitor"